Clinical trial exclusion criterion:
Pregnant or breastfeeding women

Annotated entities:
- Pregnancy_considerations: "Pregnant or breastfeeding women"